下列何者與心室顫動（ventricular fibrillation）的成因較無關？
A. 心臟肥厚（hypertrophy）
B. 心肌缺血（ischemia）
C. 血鉀過高（hyperkalemia）
D. Purkinje system 傳導阻滯

正確答案：A. 心臟肥厚（hypertrophy）